Clinical trial exclusion criteria:
Patient with fever (38C or 100.4F)
Patient less than age 4 years
Patient greater than age 16 years
Patient with hypersensitivity/allergy to either morphine, NSAIDs, or acetaminophen
Patient received acetaminophen within the past 4 hours
Patient with known liver disease or renal disease
Patient not requiring IV morphine (pain score 5/10 or less)
Patient enrolled in the study within the past 72 hours

Annotated entities:
- Condition: "fever"
- Value: "38C"
- Value: "100.4F"
- Value: "less than 4 years"
- Person: "age"
- Value: "greater than 16 years"
- Person: "age"
- Condition: "hypersensitivity"
- Condition: "allergy"
- Drug: "morphine"
- Drug: "NSAIDs"
- Drug: "acetaminophen"
- Drug: "acetaminophen"
- Temporal: "within the past 4 hours"
- Condition: "liver disease"
- Condition: "renal disease"
- Negation: "not"
- Mood: "requiring"
- Drug: "IV morphine"
- Measurement: "pain score"
- Value: "5/10 or less"
- Observation: "enrolled in the study"
- Temporal: "within the past 72 hours"